目前治療乳癌上肢淋巴水腫常用去腫脹淋巴療法（complex decongestive therapy），最少使用下列那一項？
A. 徒手淋巴引流（manual lymphatic drainage）
B. 低張力繃帶壓迫（short stretch bandaging）
C. 抬高患部作引流（elevation for drainage）
D. 淋巴退腫運動（decongestive exercise）

正確答案：C. 抬高患部作引流（elevation for drainage）